Clinical trial exclusion criterion:
need for major amputation known before intervention

Annotated entities:
- Condition: "major amputation"
- Non-representable: "known before intervention"